您在李醫師的門診跟診時，有一位懷孕 36 週的產婦向您詢問有關 B 型鏈球菌（group B Streptococcus）培養的事項，下列有關 B 型鏈球菌的敘述，何者較正確？
A. 一般產婦的陰道和直腸內很少存在此菌
B. 上一胎 B 型鏈球菌培養為陽性者，此胎也是高危險群，需直接給予預防性抗生素
C. 針對 penicillin 高度過敏（anaphylaxis）可能者，一般建議於產程開始時，直接給予 clindamycin 900 mg
D. 懷孕 37 週前生產的孕婦並不需要特別給予預防性抗生素

正確答案：A. 一般產婦的陰道和直腸內很少存在此菌